History of preterm labor and/or midtrimester miscarriage in a previous pregnancy.

The above is a clinical trial inclusion criterion. Annotated with entity spans:
History of [Condition: preterm labor] and/or [Condition: midtrimester miscarriage] in a [Temporal: previous] [Condition: pregnancy].